下列何種方法是最常用為測定乳癌前哨淋巴結摘除術（sentinel node biopsy）之方法？
A. 同位素掃描法
B. X放射線光定位方法
C. 肉眼觀看法
D. 物理檢查法

正確答案：A. 同位素掃描法